No signs of incomplete abortion

The above is a clinical trial inclusion criterion. Annotated with entity spans:
[Negation: No] [Condition: signs of incomplete abortion]